Clinical trial exclusion criterion:
Cardiovascular disease such as arrythmia, ischaemic heart disease.

Entity relations:
- Subsumes("Cardiovascular disease", "arrythmia")
- OR("arrythmia", "ischaemic heart disease")